下列降血壓藥物中，何者是透過選擇性抑制α1-receptor 而達到舒張血管的作用？
A. clonidine
B. yohimbine
C. doxazosin
D. ritodrine

正確答案：C. doxazosin